En el linfoma del manto es característica la traslocación t(11;14). ¿Qué proteína de fusión se origina, capaz de promocionar a las células hacia la fase S del ciclo celular?:
1. BCL-2.
2. Beta-2-microglobulina.
3. Ciclina D1.
4. Transreticulina.
5. Proteína ALK.

Respuesta correcta: 3. Ciclina D1.